Clinical trial exclusion criterion:
Patients that have a known psychiatric or substance abuse disorder that would interfere with cooperation with the requirements of the trial.

Entity relations:
- OR("psychiatric disorder", "substance abuse disorder")